先天雙側無輸精管（congenital bilateral absence of vas deferens）和下列那個遺傳疾病最有關？
A. 隱睪症
B. 輸尿管缺損
C. 異位性皮膚炎
D. 纖維化囊腫

正確答案：D. 纖維化囊腫